老太太跌倒後因劇烈疼痛被送到急診，檢查後發現疼痛部位為兩側腹股溝，但因兩側大腿前屈角度正常，懷疑是脊椎壓迫性骨折，下列那一節脊椎最可能有壓迫性骨折？
A. C7
B. T8
C. L1
D. L5

正確答案：C. L1